Evidence of an acute myocardial infarction = 1 month (30 days) before the intended treatment [defined as: Q wave MI, or non-Q wave MI with total CK elevation of CK-MB = twice normal in the presence of MB elevation and/or troponin level elevation (WHO definition)].

The above is a clinical trial exclusion criterion. Annotated with entity spans:
Evidence of an [Condition: acute myocardial infarction] [Temporal: = 1 month (30 days) before the intended treatment] [defined as: Q wave MI, or non-Q wave MI with total CK elevation of CK-MB = twice normal in the presence of MB elevation and/or troponin level elevation (WHO definition)].